1. Diagnosed with symptomatic sacral perineurial cysts(e.g., lumbosacral or perineal pain, fecal or urinary functions change, sexual function change, lower limb radiation pain, muscle abate, paresthesia, etc)

The above is a clinical trial inclusion criterion. Annotated with entity spans:
1. Diagnosed with [Qualifier: symptomatic] [Condition: sacral perineurial cysts(]e.g., [Condition: lumbosacral] or [Condition: perineal pain], fecal or [Condition: urinary functions change], [Condition: sexual function change], [Condition: lower limb radiation pain], [Condition: muscle abate], [Condition: paresthesia], etc)